¿Cuál de las siguientes estructuras pertenece al peritoneo?:
1. La duramadre.
2. El epiplón mayor.
3. La pleura.
4. El pericardio.
5. El bazo.

Respuesta correcta: 2. El epiplón mayor.